List types of cancer where TBC1 domain family member 16 (TBC1D16) is involved

TBC1 domain family member 16 (Tbc1D16) is involved in several types of cancer. These include epithelial ovarian cancer, gastric cancer, breast cancer, cervical cancer, adenocarcinoma, colorectal cancer, Hodgkin lymphoma, nasopharyngeal carcinoma and oral squamous cell carcinoma.